CNS disease

The above is a clinical trial inclusion criterion. Annotated with entity spans:
[Condition: CNS disease]